Clinical trial exclusion criterion:
Substance abuse.

Annotated entities:
- Condition: "Substance abuse"